Previous treatment with the ketogenic diet

The above is a clinical trial exclusion criterion. Annotated with entity spans:
[Qualifier: Previous] treatment with the [Procedure: ketogenic diet]